Clinical trial exclusion criterion:
Patients with sepsis or active infection.

Entity relations:
- OR("sepsis", "active infection")